Clinical trial exclusion criterion:
Nonspecific immunoglobulin was injected within one month

Entity relations:
- Has_temporal("Nonspecific immunoglobulin", "within one month")